Clinical trial exclusion criterion:
Uterine anomalies.

Annotated entities:
- Condition: "Uterine anomalies"